Clinical trial exclusion criterion:
Known macrovascular disease including coronary artery disease, stroke/TIA or peripheral vascular disease

Entity relations:
- Subsumes("macrovascular disease", "coronary artery disease")
- OR("coronary artery disease", "stroke", "TIA", "peripheral vascular disease")